1. Patients over the age of 85 years except at the discretion of the Investigator and with agreement of the Sponsor.

The above is a clinical trial exclusion criterion. Annotated with entity spans:
1. [Post-eligibility: Patients over the age of 85 years except at the discretion of the Investigator and with agreement of the Sponsor.]